骨骼肌收縮過程中鈣離子扮演重要的角色。罹患惡性高體溫症（malignant hyperthermia）的患者，由於肌肉細胞鈣離子持續過度的釋放，導致肌肉僵直（rigidity）、心搏加速、高體溫、過度換氣等症狀。有關鈣離子調控，下列何者錯誤？
A. 肌肉動作電位藉由肌細胞膜傳遞，促使 T-tubule 釋放鈣離子
B. 鈣離子與細肌絲（thin filament）上的 troponin 結合
C. 鈣離子再吸收是肌肉放鬆（muscle relaxation）的重要因素
D. ATP（adenosine triphosphate）是使粗肌絲（thick filament）和細肌絲間之鍵結鬆開的重要因素

正確答案：A. 肌肉動作電位藉由肌細胞膜傳遞，促使 T-tubule 釋放鈣離子